下列有關喉部（larynx）之敘述，何者錯誤？
A. 喉室（ventricle）位於前庭襞（vestibular fold）及聲襞（vocal fold）之間
B. 聲帶肌（vocalis muscle）位於聲襞之內
C. 環杓側肌與環杓後肌（lateral and posterior cricoarytenoid muscles）相互拮抗，控制前庭裂（rima vestibuli）之開關
D. 橫杓肌（transverse arytenoid muscle）收攏左右的杓狀軟骨（arytenoid cartilages）

正確答案：C. 環杓側肌與環杓後肌（lateral and posterior cricoarytenoid muscles）相互拮抗，控制前庭裂（rima vestibuli）之開關